Clinical trial inclusion criterion:
No major fetal malformations

Entity relations:
- Has_negation("major fetal malformations", "No")